Clinical trial exclusion criterion:
severe respiratory comorbidities (e.g. chronic obstructive pulmonary disease, pneumonia, respiratory failure)

Entity relations:
- Has_qualifier("respiratory comorbidities", "severe")
- Subsumes("respiratory comorbidities", "chronic obstructive pulmonary disease")
- OR("chronic obstructive pulmonary disease", "pneumonia", "respiratory failure")